下列A到D蛋白質的混合物，在適當的條件下，以凝膠過濾色層分析法（gel filtration chromatography）分離時，第二順位沖提出來的蛋白質為何？
A. 細胞色素c（cytochrome c）Mr=13,000
B. 免疫球蛋白G（immunoglobulin G）Mr=145,000
C. 核醣核酸酶A（ribonuclease A）Mr=13,700
D. 核醣核酸聚合酶（RNA polymerase）Mr=450,000

正確答案：B. 免疫球蛋白G（immunoglobulin G）Mr=145,000